Clinical trial exclusion criterion:
Subject has a reversible causes for AF like hyperthyroidism and alcoholism.

Annotated entities:
- Condition: "hyperthyroidism"
- Condition: "alcoholism"